Clinical trial exclusion criterion:
Drug abuse

Annotated entities:
- Observation: "Drug abuse"